Patients with baseline dementia

The above is a clinical trial exclusion criterion. Annotated with entity spans:
Patients with [Temporal: baseline] [Condition: dementia]